Clinical trial exclusion criterion:
Already receiving chronic analgesic therapy for a separate chronic pain condition

Entity relations:
- Has_qualifier("analgesic therapy", "chronic")
- Has_qualifier("chronic pain", "separate")
- AND("analgesic therapy", "chronic pain")